Clinical trial exclusion criterion:
1. Taking a tetracycline within 6 months or history of adverse reaction to minocycline or another tetracycline.

Annotated entities:
- Drug: "tetracycline"
- Temporal: "within 6 months"
- Temporal: "history"
- Condition: "adverse reaction"
- Drug: "minocycline"
- Drug: "tetracycline"